Clinical trial inclusion criterion:
5. Ability to ambulate with or without assistive devices

Entity relations:
- OR("Ability to ambulate without assistive devices", "Ability to ambulate with assistive devices")